Which method is behind HipMCL?

While various clustering algorithms have been proposed to find highly connected regions, Markov Clustering (MCL) has been one of the most successful approaches to cluster sequence similarity or expression networks. Despite its popularity, MCL's scalability to cluster large datasets still remains a bottleneck due to high running times and memory demands. HipMCL is a high-performance parallel implementation of the Markov clustering algorithm for large-scale networks.